下列何種皮瓣不屬於局部皮瓣（local flap）？
A. 前移皮瓣（advanced flap）
B. 足趾至手指移植（toe to hand transfer）
C. 島型血管莖皮瓣（island-pedicled flap）
D. 臀大肌 V-Y 肌皮前移皮瓣（gluteal maximal V-Y musculocutaneous advanced flap）

正確答案：B. 足趾至手指移植（toe to hand transfer）